Clinical trial inclusion criterion:
Diagnosis of probable pancreatic cancer, distal common bile duct (CBD) cholangiocarcinoma and other periampullary cancers (histology not required)

Annotated entities:
- Condition: "pancreatic cancer"
- Mood: "probable"
- Condition: "distal common bile duct (CBD) cholangiocarcinoma"
- Condition: "periampullary cancers"
- Qualifier: "other"